下列有關腸脛骨束摩擦症候群（iliotibial band friction syndrome）之敘述，何者有誤？
A. 長期從事跑步運動者易罹患此疾病
B. 疼痛易發生於膝蓋外側
C. 疼痛易發生於髕骨肌腱
D. 常須伸展運動治療病人之疼痛

正確答案：C. 疼痛易發生於髕骨肌腱